Patients diagnosed with primary or secondary fibromyalgia.

The above is a clinical trial inclusion criterion. Annotated with entity spans:
Patients diagnosed with [Qualifier: primary] or [Qualifier: secondary] [Condition: fibromyalgia].